Clinical trial exclusion criterion:
Gastrointestinal or genitourinary bleeding within the prior 3 months, or major surgery within 2 months.

Annotated entities:
- Condition: "genitourinary bleeding"
- Condition: "Gastrointestinal bleeding"
- Temporal: "within the prior 3 months"
- Procedure: "major surgery"
- Temporal: "within 2 months"